頭頸部諸副交感神經之神經節當中解剖位置最後（posterior）者為：
A. 下頜下神經節（submandibular ganglion）
B. 翼腭神經節（pterygopalatine ganglion）
C. 耳神經節（otic ganglion）
D. 睫狀神經節（ciliary ganglion）

正確答案：C. 耳神經節（otic ganglion）